Clinical trial exclusion criterion:
Fasting cholesterol > 1.6 upper limits of normal.

Annotated entities:
- Measurement: "Fasting cholesterol"
- Value: "> 1.6 upper limits of normal"